ASA 4 or 5

The above is a clinical trial exclusion criterion. Annotated with entity spans:
[Measurement: ASA] [Value: 4 or 5]